Clinical trial inclusion criterion:
Left ventricular ejection fraction (LVEF) = 45%

Annotated entities:
- Measurement: "Left ventricular ejection fraction (LVEF)"
- Value: "= 45%"